Siguiendo la clasificación de Pervin (1979) y Campbell (1953-1957) sobre los Métodos de recogida de información, señale una de las técnicas representativa de la metodología psicométrica:
1. La Escala de Inteligencia de Wechsler.
2. Frases incompletas, de Kelly y Fisher.
3. Test de Apercepción Temática, de Murray.
4. Test de Constructos personales, de Kelly (1955).
5. Los autorregistros.

Respuesta correcta: 1. La Escala de Inteligencia de Wechsler.